Clinical trial exclusion criterion:
tortuousity (greater than 60 degree angle) that makes it unsuitable for proper stent delivery and deployment,

Annotated entities:
- Condition: "tortuousity"
- Value: "greater than 60 degree"
- Measurement: "angle"
- Procedure: "stent delivery and deployment"
- Qualifier: "unsuitable for proper"
- Subjective_judgement: "unsuitable for proper"